Subject is capable of understanding and complying with protocol demands and able to sign and date the informed consent

The above is a clinical trial inclusion criterion. Annotated with entity spans:
[Non-query-able: Subject is capable of understanding and complying with protocol demands and able to sign and date the informed consent]